Clinical trial exclusion criterion:
Weight < 10 kg

Entity relations:
- Has_value("Weight", "< 10 kg")